下列有關 sphingolipid 合成之敘述，何者正確？
A. 所有來自 palmitate 和 serine 的碳原子都包含入 sphingosine
B. Phosphatidic acid 是一個主要的中間產物
C. CDP-sphingosine 是一個活化的中間產物
D. 由 palmitate 和 serine 合成 ceramide 時，同時會產生二氧化碳

正確答案：D. 由 palmitate 和 serine 合成 ceramide 時，同時會產生二氧化碳